Intubated patients (prior to randomization)

The above is a clinical trial exclusion criterion. Annotated with entity spans:
[Condition: Intubated] patients ([Temporal: prior to randomization])